Any cases converted to abdominal hysterectomy or other additional elective surgical procedures performed at time of abdominal myomectomy will be excluded from data analysis

The above is a clinical trial exclusion criterion. Annotated with entity spans:
Any cases [Mood: converted to] [Procedure: abdominal hysterectomy] or [Qualifier: other] [Qualifier: additional] [Qualifier: elective] [Procedure: surgical procedures] performed [Temporal: at time of abdominal myomectomy] will be excluded from data analysis